Clinical trial exclusion criterion:
2. History of allergic reactions to TGR-1202 or carfilzomib

Entity relations:
- AND("allergic reactions", "TGR-1202")
- Has_temporal("allergic reactions", "History")
- OR("TGR-1202", "carfilzomib")